Clinical trial exclusion criterion:
Age< 18

Annotated entities:
- Person: "Age"
- Value: "< 18"